Exposure to more than four new chemical entities within 12 months prior to the first dosing day.

The above is a clinical trial exclusion criterion. Annotated with entity spans:
Exposure to [Multiplier: more than four] [Drug: new chemical entities] [Temporal: within 12 months prior to the first dosing day].